陳先生是一位 28 歲的電力公司新進員工，1 個小時前受到 11000 伏特電擊傷，尿液常規檢查（urinalysis）顯示，外觀呈暗褐色，pH 值 7.28，潛血反應 4+，蛋白質 2+，酮體- ，紅血球 2~6/高倍視野（high power field, HPF），細菌（- ）。下列診斷何者最適當？
A. 急性腎衰竭（acute renal failure）
B. 低容積性休克（hypovolemic shock）
C. 肌球蛋白尿症（myoglobulinuria）
D. 代謝性酸中毒（metabolic acidosis）

正確答案：C. 肌球蛋白尿症（myoglobulinuria）